Clinical trial inclusion criterion:
Age =18 years

Entity relations:
- Has_value("Age", "=18 years")